¿Qué sonidos consonánticos del castellano se adquieren más tarde por su dificultad de articulación originando un trastorno fonológico?
1. Africados, líquidos y nasales.
2. Fricativos, nasales y oclusivos.
3. Líquidos, fricativos y africados.
4. Nasales, oclusivos y africados.
5. Oclusivos, fricativos y líquidos.

Respuesta correcta: 3. Líquidos, fricativos y africados.